Previous therapy with BBIT (basal insulin and at least once daily bolus insulin)

The above is a clinical trial inclusion criterion. Annotated with entity spans:
[Temporal: Previous] [Procedure: therapy] with [Drug: BBIT] ([Drug: basal insulin and at least once daily bolus insulin])